Uncontrolled intercurrent illness, including but not limited to ongoing or active infection requiring parenteral antibiotics at enrollment

The above is a clinical trial exclusion criterion. Annotated with entity spans:
[Qualifier: Uncontrolled] [Condition: intercurrent illness], including but not limited to [Temporal: ongoing] or [Qualifier: active] [Condition: infection] requiring [Drug: parenteral antibiotics] [Temporal: at enrollment]